Las moléculas aquirales que contienen centros de quiralidad se denominan:
1. Enantiómeros.
2. Diastereoisómeros.
3. Formas meso.
4. Racémicos.

Respuesta correcta: 3. Formas meso.